裘馨氏肌失養症（Duchenne muscular dystrophy）的患童常以德氏步態（Trendelenberg gait）走路，是因為下列那一條肌肉無力所造成？
A. 髂腰肌（iliopsoas）
B. 臀中肌（gluteus medius）
C. 臀大肌（gluteus maximus）
D. 髖內收肌（hip adductors）

正確答案：B. 臀中肌（gluteus medius）